Clinical trial inclusion criterion:
LVEF <45%

Entity relations:
- Has_value("LVEF", "<45%")